Proteinuria >1 gram/day at time of possible conversion

The above is a clinical trial exclusion criterion. Annotated with entity spans:
[Measurement: Proteinuria] [Value: >1 gram/day] [Temporal: at time of possible conversion]